Which test is used for the definition of colour-blindness?

Color-blindness problems are detected by the Ishihara Test.